Current medication use which interact with either aspirin or atorvastatin

The above is a clinical trial exclusion criterion. Annotated with entity spans:
[Temporal: Current] [Drug: medication] use which [Condition: interact] with either [Drug: aspirin] or [Drug: atorvastatin]